known coagulation disorders

The above is a clinical trial exclusion criterion. Annotated with entity spans:
known [Condition: coagulation disorders]